What are the indications for treatment with anti-hepcidin?

improving anemia control
anemia management in hemodialysis
iron-restricted anemias